Patients who have received a transplant besides liver.

The above is a clinical trial exclusion criterion. Annotated with entity spans:
Patients who have received a [Procedure: transplant] besides [Qualifier: liver].